Clinical trial inclusion criterion:
At least one measurable lesion;

Annotated entities:
- Multiplier: "At least one"
- Condition: "lesion"